Clinical trial exclusion criterion:
Subjects who are currently treated with sildenafil for PAH or taking sildenafil or tadalafil.

Annotated entities:
- Drug: "sildenafil"
- Condition: "PAH"
- Drug: "sildenafil"
- Drug: "tadalafil"
- Temporal: "currently"